Which gene test can be used for the X-linked myotubular myopathy?

Genetic testing of the MTM1 gene can be used for the X-linked myotubular myopathy.